Clinical trial exclusion criterion:
Glaucoma, pheochromocytoma, or known or suspected hypersensitivity to methylphenidate or its excipients

Entity relations:
- AND("hypersensitivity", "methylphenidate or its excipients")
- AND("methylphenidate or its excipients", "its excipients")
- Has_context("hypersensitivity", "known")
- OR("methylphenidate or its excipients", "its excipients")
- OR("known", "suspected")
- OR("Glaucoma", "pheochromocytoma", "hypersensitivity")